4. Right-handed.

The above is a clinical trial inclusion criterion. Annotated with entity spans:
[Parsing_Error: 4.] [Condition: Right-handed].